13. Body mass index ≥35.0 at Screening.

The above is a clinical trial exclusion criterion. Annotated with entity spans:
[Parsing_Error: 13.] [Measurement: Body mass index] [Value: ≥35.0] [Temporal: at Screening].